有關心包膜疾病的敘述，下列何者錯誤？
A. 心包膜本身是一個雙層袋子，包括有visceral pericardium以及parietal pericardium兩層，之間由15～50毫升的心包膜液來分開
B. 在急性心包膜發炎時，病患可能會出現有較為低頻（low-pitch）的friction rub的心音，在病患前傾，在呼氣
C. 在心電圖的表現上，早期較常看見廣泛性的ST節上升
D. 在cardiac tamponade時有一個Beck's triad：低血壓，心音聲音消失，頸靜脈怒張有明顯的X descent以及消失的Y descent

正確答案：B. 在急性心包膜發炎時，病患可能會出現有較為低頻（low-pitch）的friction rub的心音，在病患前傾，在呼氣